Fas的基因剔除小鼠（gene knockout mice）會產生何種自體免疫病變？
A. 發炎性腸道疾病（inflammatory bowel disease）
B. 淋巴球增生疾病（lymphoproliferative disease）
C. 類風濕性關節炎（rheumatoid arthritis）
D. 去髓鞘病變（demyelinating disease）

正確答案：B. 淋巴球增生疾病（lymphoproliferative disease）